Clinical trial inclusion criterion:
The subject has given written informed, dated consent to participate in the study

Annotated entities:
- Observation: "given written informed consent"